Clinical trial exclusion criterion:
Administration of other antiarrhythmics for acute heart rate control (excluding adenosine)

Annotated entities:
- Drug: "antiarrhythmics"
- Qualifier: "acute"
- Procedure: "heart rate control"
- Negation: "excluding"
- Drug: "adenosine"